List characteristics of Developmental and Epileptic Encephalopathies (DEEs).

Clinical characteristics of Developmental and Epileptic Encephalopathies (DEEs) include global developmental delay, contractures, refractory seizures, intractable seizures, epilepsy, facial dysmorphism, macrocephaly, cognitive deficits, autism, seizures, cerebellar dysgenesis, developmental delayed, behavioral abilities, developmental impairment or regression, intellectual disability, and brain anomalies.